下列有關myosin light-chain phosphatase之功能敘述，何者正確？
A. 造成myosin light-chain的磷酸化，促使cross-bridge cycling進行
B. 造成myosin light-chain的去磷酸化，抑制cross-bridge cycling進行
C. 與Ca2+結合，促使cross-bridge cycling進行
D. 抑制Ca2+釋放至細胞質，抑制cross-bridge cycling進行

正確答案：B. 造成myosin light-chain的去磷酸化，抑制cross-bridge cycling進行